Clinical trial exclusion criterion:
Patients who do not agree to the proposed treatment or will receive (part of) the treatment in a non-participating centre

Entity relations:
- Has_negation("agree to the proposed treatment", "not")
- AND("treatment", "non-participating centre")